有關箝閉性（Incarcerated）腹股溝疝氣之敘述，下列何者錯誤？
A. 通常合併有腸阻塞
B. 疝氣部位表皮若出現紫紅色變化，宜儘速給予疝氣復位（Reduction）
C. 會有局部疼痛及壓痛
D. 若手術中發現疝氣袋內小腸合併有缺血性壞死，小腸切除及吻合後，可同時進行疝氣修補手術

正確答案：B. 疝氣部位表皮若出現紫紅色變化，宜儘速給予疝氣復位（Reduction）